History of active substance abuse (including alcohol > 40g/day) within the past 2 years.

The above is a clinical trial exclusion criterion. Annotated with entity spans:
[Temporal: History] of [Qualifier: active] [Condition: substance abuse] (including [Measurement: alcohol] [Value: > 40g/day]) [Temporal: within the past 2 years].